¿Cuál de las siguientes estructuras nerviosas participa en la inervación visceral simpática?:
1. Nervios esplácnicos pélvicos.
2. Nervios esplácnicos lumbares.
3. El nervio vago.
4. Plexo lumbar.

Respuesta correcta: 2. Nervios esplácnicos lumbares.